Which drugs are included in the IROX regimen for colorectal cancer?

IROX regimen for colorectal cancer includes irinotecan and oxaliplatin.